Clinical trial inclusion criterion:
Eastern Cooperative Oncology Group (ECOG) performance status =< 1

Annotated entities:
- Measurement: "Eastern Cooperative Oncology Group performance status"
- Value: "=< 1"
- Measurement: "ECOG"